symptomatic Dupuytrens contracture with palpable cord, involving MCP, total contracture size over 30 degrees

The above is a clinical trial inclusion criterion. Annotated with entity spans:
[Qualifier: symptomatic] [Condition: Dupuytrens contracture] with [Condition: palpable cord], [Qualifier: involving MCP], [Measurement: total contracture size] [Value: over 30 degrees]